Clinical trial exclusion criterion:
Patients with communication problems (critically ill, unconscious, language barrier despite use of secure telephone-based translation service)

Annotated entities:
- Condition: "communication problems"
- Undefined_semantics: "communication problems"
- Condition: "critically ill"
- Condition: "unconscious"
- Condition: "language barrier"